Clinical trial exclusion criterion:
suffering major events or having mood swings.

Annotated entities:
- Condition: "major events"
- Condition: "mood swings"